Clinical trial inclusion criterion:
Plan on having continued sexual contact with partner

Entity relations:
- Has_mood("having continued sexual contact with partner", "Plan on")